Clinical trial exclusion criterion:
aged less than 20 years

Annotated entities:
- Person: "aged"
- Value: "less than 20 years"